Clinical trial exclusion criterion:
Is dialysis-dependent or has (or is suspected of having) severe renal insufficiency (defined as estimated glomerular filtration rate (eGFR) <30 ml/min).

Entity relations:
- Has_value("estimated glomerular filtration rate (eGFR)", "<30 ml/min")
- Subsumes("severe renal insufficiency", "estimated glomerular filtration rate (eGFR)")
- OR("dialysis-dependent", "severe renal insufficiency")